心電圖在 lead I, aVL 出現急性心肌梗塞變化，乃顯示心肌那個部位發生梗塞？
A. inferior wall
B. lateral wall
C. anteroseptal wall
D. posterior wall

正確答案：B. lateral wall